Clinical trial inclusion criterion:
Meet the clinical (Amsel) criteria for BV

Entity relations:
- Subsumes("criteria clinical", "Amsel criteria")
- Has_qualifier("BV", "criteria clinical")